下列有關膽管癌之敘述，何者錯誤？
A. 根據發生位置可分為肝內、肝門處與遠端膽管癌，而最好發的位置是肝內膽管癌
B. 超過90%遠端或肝門處膽管癌病患之臨床表現為阻塞性黃疸
C. 肝門處膽管癌在電腦斷層掃描檢查中不易看到腫瘤，反而是看到肝內膽管擴大與變小的膽囊
D. 對於Bismuth分類type I & II肝門處膽管癌若無肝門處血管侵犯，可考慮局部腫瘤切除，並利用空腸作膽道重建

正確答案：A. 根據發生位置可分為肝內、肝門處與遠端膽管癌，而最好發的位置是肝內膽管癌